Clinical trial exclusion criterion:
A history of having inadequate response to adequate SSRIs or CBT treatment

Annotated entities:
- Drug: "SSRIs"
- Drug: "CBT"
- Condition: "response"
- Qualifier: "inadequate"